Clinical trial inclusion criterion:
Nonsmoking for 4 months prior to initial interview and throughout screening

Annotated entities:
- Condition: "Nonsmoking"
- Temporal: "for 4 months prior to initial interview"
- Reference_point: "initial interview"
- Temporal: "throughout screening"
- Reference_point: "screening"